Clinical trial inclusion criteria:
Patient must meet 1987 ACR criteria
Age > 18 years of age
Baseline DAS28/Erythrocyte Sedimentation Rate (ESR) >=3.2
Stable concomitant Disease Modifying Anti-Rheumatic Drugs (DMARDs)
Stable prednisone <10mg or equivalent
Power Doppler score of >=10

Annotated entities:
- Condition: "1987 ACR criteria"
- Person: "Age"
- Value: "> 18 years of age"
- Temporal: "Baseline"
- Measurement: "DAS28/Erythrocyte Sedimentation Rate (ESR)"
- Value: ">=3.2"
- Multiplier: "Stable"
- Temporal: "concomitant"
- Drug: "Disease Modifying Anti-Rheumatic Drugs (DMARDs)"
- Multiplier: "Stable"
- Drug: "prednisone"
- Value: "<10mg"
- Measurement: "Power Doppler score"
- Value: ">=10"